Exposure to sun or UV radiations, 15 days before the patch testing.

The above is a clinical trial exclusion criterion. Annotated with entity spans:
[Condition: Exposure to sun] or UV radiations, [Temporal: 15 days before the patch testing].